Clinical trial exclusion criterion:
History of substance dependence diagnosis by MINI-KID (excluding tobacco) or positive urine toxicology.

Entity relations:
- Has_negation("tobacco", "excluding")
- AND("substance dependence", "tobacco")
- Has_value("urine toxicology", "positive")
- Has_temporal("substance dependence", "History")
- AND("substance dependence", "MINI-KID")
- OR("substance dependence", "urine toxicology")